¿Se puede considerar que el ozono es un buen oxidante?:
1. No. Es un potente reductor. De hecho, se emplea habitualmente para obtener hidrógeno del agua (reduciendo los protones del agua).
2. No, ni siquiera es capaz de oxidar el ioduro a iodo.
3. Sí. A veces transfiere además un átomo de oxígeno al reductor.
4. Sí, pero en la práctica no se puede emplear porque es imposible obtener ozono salvo en la estratosfera.

Respuesta correcta: 3. Sí. A veces transfiere además un átomo de oxígeno al reductor.